Clinical trial exclusion criterion:
known chronic diarrheal disease (celiac disease, lactose malabsorption, Inflammatory bowel diseases, incl microscopic colitis)

Annotated entities:
- Condition: "chronic diarrheal disease"
- Condition: "celiac disease"
- Condition: "lactose malabsorption"
- Condition: "Inflammatory bowel diseases"
- Condition: "microscopic colitis"